類固醇眼藥水不適合用於下列何種眼疾？
A. 流行性角結膜炎（epidemic keratoconjunctivitis）
B. 盤狀角膜炎（disciform keratitis）
C. 急性前虹膜炎（acute anterior uveitis）
D. 單純疱疹樹枝狀角膜炎（herpes simplex dendritic keratitis）

正確答案：D. 單純疱疹樹枝狀角膜炎（herpes simplex dendritic keratitis）